Clinical trial exclusion criterion:
Previous anaphylaxis following any component of Bexsero vaccine

Annotated entities:
- Condition: "anaphylaxis"
- Temporal: "Previous"
- Drug: "Bexsero vaccine"